Clinical trial exclusion criterion:
History of allergies to phenol, any of the antibiotics listed in the vaccine content, or any other component of ACAM2000 or its diluents.

Annotated entities:
- Condition: "allergies"
- Drug: "phenol"
- Procedure: "antibiotics"
- Qualifier: "listed in the vaccine content"
- Procedure: "vaccine"
- Drug: "ACAM2000"
- Drug: "ACAM2000 diluents"